Clinical trial inclusion criterion:
Be willing to abstain from using any nicotine patches, e-cigarettes, or marijuana for the duration of the study.

Annotated entities:
- Non-query-able: "Be willing to abstain from using any nicotine patches, e-cigarettes, or marijuana for the duration of the study."